Respecto a la vacunación con vacuna de rubeola en embarazadas, señale la respuesta correcta:
1. Debe de estimularse ya que es muy conveniente para la Salud Pública.
2. Es el procedimiento de elección para el control del síndrome de rubeola congénita.
3. No se considera ya como una indicación de aborto.
4. Es permitida en el caso de las vacunas de la cepa RA 27/3, pero no en el caso de las vacunas de la cepa Cendehill.
5. Se debe administrar conjuntamente con inmunoglobulina específica

Respuesta correcta: 3. No se considera ya como una indicación de aborto.